Clinical trial exclusion criterion:
Cerebrospinal Fluid (CSF) leak

Annotated entities:
- Condition: "Cerebrospinal Fluid (CSF) leak"